Clinical trial exclusion criteria:
Patients with >14 follicles on day of trigger
Previous hyperresponse with OHSS development
Previous low response (less than 3 oocytes on a high dose of FSH stimulation)
Endocrine disorders

Annotated entities:
- Value: ">14"
- Measurement: "follicles"
- Temporal: "on day of trigger"
- Reference_point: "day of trigger"
- Condition: "hyperresponse"
- Observation: "OHSS development"
- Temporal: "Previous"
- Condition: "low response"
- Temporal: "Previous"
- Measurement: "oocytes"
- Value: "less than 3"
- Procedure: "high dose of FSH stimulation"
- Condition: "Endocrine disorders"